Clinical trial exclusion criterion:
Pregnants

Annotated entities:
- Condition: "Pregnants"